Clinical trial exclusion criterion:
Co-infection with hepatitis B virus, HIV

Entity relations:
- OR("hepatitis B virus", "HIV")